當病患坐在輪椅上，足部有蹠屈（plantar flexion）的問題時，下列敘述何者錯誤？
A. 可能是病患的正向支持反應（positive supporting reaction）所造成
B. 因為腳板（footrest）的高度太高
C. 調整腳板的高度，將足部維持在稍微背屈（dorsiflexion）的姿勢
D. 可能與足跟攣縮（heel cord contracture）有關

正確答案：B. 因為腳板（footrest）的高度太高